有關肌肉的長度或張力偵測系統（length- or tension-monitoring system），下列敘述何者正確？
A. muscle spindle 透過 Ib fiber 負責偵測張力
B. muscle spindle 透過 Ia fiber 負責偵測長度
C. Golgi tendon organ 透過 Ib fiber 負責偵測長度
D. Golgi tendon organ 透過 Ia fiber 負責偵測張力

正確答案：B. muscle spindle 透過 Ia fiber 負責偵測長度